Clinical trial exclusion criterion:
Lifetime history of 5 or more migraine or probable migraine headaches pre-dating mTBI

Entity relations:
- Has_qualifier("migraine", "probable")
- Has_index("pre-dating mTBI", "mTBI")
- multi("mTBI", "mTBI")
- Has_multiplier("migraine", "5 or more")
- Has_temporal("migraine", "Lifetime history")
- Has_temporal("migraine", "pre-dating mTBI")
- OR("migraine", "migraine")